Bilateral Lower extremity involvement of the suspected infection.

The above is a clinical trial exclusion criterion. Annotated with entity spans:
[Qualifier: Bilateral Lower extremity] involvement of the suspected [Condition: infection].